Clinical trial exclusion criterion:
AF secondary to electrolyte imbalance, thyroid disease, or reversible or non-cardiac cause.

Entity relations:
- AND("secondary", "electrolyte imbalance")
- Has_qualifier("AF", "secondary")
- Has_qualifier("non-cardiac cause", "reversible")
- OR("AF", "thyroid disease", "non-cardiac cause")